Clinical trial exclusion criterion:
Current or past diagnoses of other Axis I psychiatric disorders, except for generalized anxiety disorder (GAD) symptoms occurring during a depressive episode

Entity relations:
- Has_index("during a depressive episode", "depressive episode")
- AND("depressive episode", "depressive episode")
- Has_negation("generalized anxiety disorder (GAD)", "except for")
- Has_temporal("generalized anxiety disorder (GAD)", "during a depressive episode")
- Has_qualifier("Axis I psychiatric disorders", "other")
- AND("Axis I psychiatric disorders", "generalized anxiety disorder (GAD)")